若懷疑病人有橋本氏症（Hashimoto's thyroiditis）造成甲狀腺功能低下，檢查下列何種抗體最能佐證？
A. anti-dsDNA antibody
B. anti-IgG4 antibody
C. anti-TSH receptor antibody
D. anti-thyroglobulin antibody, anti-thyroid peroxidase antibody

正確答案：D. anti-thyroglobulin antibody, anti-thyroid peroxidase antibody